Clinical trial exclusion criterion:
Patients with a personal or family history of medullary thyroid carcinoma or patients with Multiple Endocrine Neoplasia syndrome type 2

Entity relations:
- Has_temporal("medullary thyroid carcinoma", "personal history")
- OR("personal history", "family history")
- OR("medullary thyroid carcinoma", "Multiple Endocrine Neoplasia syndrome type 2")